Clinical trial inclusion criterion:
aged = 6 months

Annotated entities:
- Person: "aged"
- Value: "= 6 months"